Clinical trial exclusion criterion:
Severe bruxism or clenching habits

Entity relations:
- OR("bruxism", "clenching habits")